Clinical trial exclusion criterion:
Confirmed testosterone < 100 ng/dL

Annotated entities:
- Measurement: "Confirmed testosterone"
- Value: "< 100 ng/dL"